Clinical trial exclusion criterion:
Known allergies to aspirin, ticagrelor or cangrelor

Entity relations:
- AND("allergies", "aspirin")
- OR("aspirin", "ticagrelor", "cangrelor")